Serotonin 是由那一個胺基酸衍生合成？
A. tyrosine
B. tryptophan
C. arginine
D. lysine

正確答案：B. tryptophan